Which is the target of belimumab in Systemic Lupus Erythematosus treatment?

Belimumab, a fully human monoclonal antibody against B lymphocyte stimulator (BLyS), was licensed in 2011 for the treatment of autoantibodies to Systemic Lupus Erythematosus.